Las reacciones en las cuales no hay intermedios se describen como:
1. Concertadas.
2. Polares.
3. Radicalarias.
4. Homolíticas.
5. Heterolíticas.

Respuesta correcta: 1. Concertadas.